下列那個輔酶（coenzyme）可輔助轉胺酶（aminotransferase）進行胺基（amino group）之傳遞反應？
A. NAD+
B. FAD
C. 磷酸吡哆醛（pyridoxal phosphate）
D. 硫胺素焦磷酸（thiamine pyrophosphate）

正確答案：C. 磷酸吡哆醛（pyridoxal phosphate）